Clinical trial exclusion criterion:
Serum Alanine Aminotransferase (ALT) > triple the upper limit of the normal range; and/or

Annotated entities:
- Measurement: "Serum Alanine Aminotransferase"
- Measurement: "ALT"
- Value: "> triple the upper limit of the normal range"
- Non-query-able: "and/or"